Clinical trial exclusion criterion:
Contraindication or intolerance to evidence-based therapy for CHF, such as beta-blocker, angiotensin-converting enzyme inhibitor or angiotensin receptor blocker.

Entity relations:
- AND("evidence-based therapy", "CHF")
- AND("Contraindication", "evidence-based therapy")
- Subsumes("Contraindication", "beta-blocker")
- OR("beta-blocker", "angiotensin-converting enzyme inhibitor", "angiotensin receptor blocker")
- OR("Contraindication", "intolerance")